Peptic ulcer or reflux esophagitis

The above is a clinical trial exclusion criterion. Annotated with entity spans:
[Condition: Peptic ulcer] or [Condition: reflux esophagitis]